Clinical trial exclusion criterion:
4. Baseline ejection fraction ≤ 50% as assessed by echocardiogram or MUGA.

Annotated entities:
- Parsing_Error: "4."
- Measurement: "ejection fraction"
- Temporal: "Baseline"
- Value: "≤ 50%"
- Procedure: "echocardiogram"
- Procedure: "MUGA"